有關神經元細胞體的位置，下列敘述何者正確？①灰質 ②白質 ③神經節 ④周邊神經纖維
A. ①④
B. ①③
C. ②③
D. ②④

正確答案：B. ①③